En España, el órgano encargado de determinar las condiciones especiales de prescripción y dispensación de medicamentos en el Sistema Nacional de Salud (S.N.S.) es:
1. La Agencia Española de Medicamentos y Productos Sanitarios.
2. El Instituto Nacional de Consumo.
3. La Dirección General de Cartera Básica de Servicios del S.N.S. y Farmacia.
4. La Secretaría General Técnica.
5. La Dirección General de Salud Pública, Calidad e Innovación.

Respuesta correcta: 3. La Dirección General de Cartera Básica de Servicios del S.N.S. y Farmacia.